Clinical trial exclusion criterion:
Subjects currently consuming =5 units of alcohol per day

Entity relations:
- Has_value("consuming alcohol per day", "=5 units")
- Has_temporal("consuming alcohol per day", "currently")